able to provide informed consent

The above is a clinical trial inclusion criterion. Annotated with entity spans:
[Informed_consent: able to provide informed consent]